電影中「雙面夏娃」形容一女性患者體內存在著完全不同人格特質的分身，此一分身常在壓力情境下出現。此種情況屬於下列何種臨床診斷？
A. 類精神分裂人格疾患（schizoid personality disorder）
B. 雙極性疾患（bipolar disorder）
C. 解離性疾患（dissociative disorder）
D. 妄想症（delusional disorder）

正確答案：C. 解離性疾患（dissociative disorder）